Must meet the following definition for adhesive capsulitis as defined by the American Academy of Orthopedic Surgeons: Self-limiting condition resulting from any inflammatory process about the shoulder in which capsular scar tissue is produced, resulting in pain and limited range of motion; also called frozen shoulder

The above is a clinical trial inclusion criterion. Annotated with entity spans:
Must meet the following definition for [Condition: adhesive capsulitis] as defined by the [Measurement: American Academy of Orthopedic Surgeons]: [Non-query-able: Self-limiting condition resulting from any inflammatory process about the shoulder in which capsular scar tissue is produced, resulting in pain and limited range of motion; also called frozen shoulder]